粒線體氧化磷酸化的過程所產生H2O2，可由下列那一種酵素去除？
A. glutathione reductase
B. glutathione peroxidase
C. superoxide dismutase
D. pyruvate dehydrogenase

正確答案：B. glutathione peroxidase